Clinical trial exclusion criterion:
Subjects with any pre or intra-operative findings identified by the surgeon that may preclude conduct of the study procedure.

Annotated entities:
- Non-query-able: "Subjects with any pre or intra-operative findings identified by the surgeon that may preclude conduct of the study procedure"